Which disease is caused by de novo VPS4A mutations?

De νovo VPS4A mutations cause multisystem disease with abnormal neurodevelopment.